Patients are advised not to participate in the gentamicin arm if

The above is a clinical trial exclusion criterion. Annotated with entity spans:
[Non-representable: Patients are advised not to participate in the gentamicin arm if]